Clinical trial inclusion criterion:
Subjects age 21 and older

Entity relations:
- AND("21 and older", "age")